Al tipo especializado de tejido conjuntivo blando y difuso, llamado tejido mieloide, también se le denomina:
1. Médula espinal.
2. Medula ósea.
3. Mielina.
4. Médula endocondral.
5. Leucomielina.

Respuesta correcta: 2. Medula ósea.